Availability of patient's medical records data about the previous treatment with ADASUVE® at hospital setting.

The above is a clinical trial inclusion criterion. Annotated with entity spans:
[Non-query-able: Availability of patient's medical records data about the previous treatment with ADASUVE® at hospital setting].